Clinical trial exclusion criterion:
1. History of colorectal surgery

Annotated entities:
- Procedure: "colorectal surgery"
- Temporal: "History"
- Parsing_Error: "1."